某人綁著安全帶（seat belt）開車，與來車對撞發生第一腰椎骨析，其骨折最可能是屬於：
A. 壓迫性骨折（compression fracture）
B. 爆炸性骨折（burst fracture）
C. 屈曲－牽開性骨折（flexion-distraction fracture）
D. 骨折脫臼（fracture-dislocation）

正確答案：C. 屈曲－牽開性骨折（flexion-distraction fracture）